5. Acute myocardial infarction, cardiac ischemia indicated by 6-minute walk test, hypertrophic cardiomyopathy, constrictive pericarditis, significant valve disease or congenital heart disease, severe pulmonary hypertension;

The above is a clinical trial exclusion criterion. Annotated with entity spans:
5. [Condition: Acute myocardial infarction], [Condition: cardiac ischemia] indicated by [Procedure: 6-minute walk test], [Condition: hypertrophic cardiomyopathy], [Condition: constrictive pericarditis], [Qualifier: significant] [Condition: valve disease] or [Condition: congenital heart disease], [Condition: severe pulmonary hypertension];